Has been diagnosed with cancer and who will be undergoing chemotherapy or radiation therapy during the vaccination healing time.

The above is a clinical trial exclusion criterion. Annotated with entity spans:
Has been [Condition: diagnosed with cancer] and who will be undergoing [Procedure: chemotherapy] or [Procedure: radiation therapy] [Temporal: during the vaccination healing time].